Clinical trial exclusion criterion:
18. A psychiatric condition (e.g., suicidal ideation) or chronic alcohol or drug abuse problem, determined from the patient's medical history, which, in the opinion of the investigator, may pose a threat to patient compliance

Annotated entities:
- Parsing_Error: "18."
- Condition: "psychiatric condition"
- Condition: "suicidal ideation"
- Condition: "alcohol abuse problem"
- Condition: "drug abuse problem"
- Subjective_judgement: "in the opinion of the investigator"
- Subjective_judgement: "pose a threat"
- Qualifier: "may pose a threat to patient compliance"